presence of contraindications, current or past allergic or adverse reaction, or known sensitivity to cannabinoid-like substances (dronabinol/marijuana/cannabis/THC, cannabinoid oil, sesame oil, gelatin, glycerin, and titanium dioxide)

The above is a clinical trial exclusion criterion. Annotated with entity spans:
presence of [Condition: contraindications], [Temporal: current] or [Temporal: past] [Condition: allergic] or [Condition: adverse reaction], or known [Condition: sensitivity] to [Drug: cannabinoid-like substances] ([Drug: dronabinol]/[Drug: marijuana]/[Drug: cannabis]/[Drug: THC], [Drug: cannabinoid oil], [Drug: sesame oil], [Drug: gelatin], [Drug: glycerin], and [Drug: titanium dioxide])